What is the phenomenon described as "complex coacervation"?

Complex coacervation is a phase separation process that is mediated by the charges of the components involved.